Clinical trial exclusion criterion:
Optune compliance < 75%; they would be excluded from the final analyses.

Annotated entities:
- Observation: "Optune compliance"
- Multiplier: "< 75%"
- Non-query-able: "they would be excluded from the final analyses"